For how long do Drosophila embryos use maternal genome mRNA?

mitoses before interphase 14 run on maternal products and occur in metasynchronous waves